Clinical trial exclusion criterion:
Diamond Blackfan anemia;

Annotated entities:
- Condition: "Diamond Blackfan anemia"